神經肌肉阻斷劑 doxacurium 的作用機轉是：
A. 阻斷 acetylcholine 釋放
B. 抑制 cholinesterase
C. 阻斷 muscarinic receptor
D. 阻斷 motor end-plate 上 nicotinic receptor

正確答案：D. 阻斷 motor end-plate 上 nicotinic receptor